Clinical trial exclusion criterion:
kidney failure (creatinin > 2 g/dl, creatinin <clearance 30 ml/h) and/or hepatic failure (cholinesterase < 2000 UI);

Entity relations:
- Has_value("creatinin", "> 2 g/dl")
- Has_value("creatinin <clearance", "30 ml/h")
- Has_value("cholinesterase", "< 2000 UI")
- Subsumes("hepatic failure", "cholinesterase")
- Subsumes("kidney failure", "creatinin")
- OR("creatinin", "creatinin <clearance")
- OR("kidney failure", "hepatic failure")